History of liver cirrhosis, chronic kidney disease, malignancy, inflammatory bowel disease, significant infectious disease, polyposis syndrome

The above is a clinical trial exclusion criterion. Annotated with entity spans:
[Temporal: History] of [Condition: liver cirrhosis], [Condition: chronic kidney disease], [Condition: malignancy], [Condition: inflammatory bowel disease], [Condition: significant infectious disease], [Condition: polyposis syndrome]